Clinical trial exclusion criterion:
Multiple premature ventricular or atrial contractions

Entity relations:
- OR("Multiple premature ventricular contractions", "Multiple premature atrial contractions")